Clinical trial exclusion criterion:
Ongoing acute kidney injury Stage 2/3

Entity relations:
- Has_value("Stage", "2/3")
- AND("acute kidney injury", "Stage")